Clinical trial exclusion criterion:
usage of painkiller before surgery

Entity relations:
- Has_temporal("painkiller", "before surgery")